對於 Methicillin-resistant Staphylococcus aureus 感染之單獨或合併治療，下列那項藥物最不適合？
A. Fluoroquinolones
B. Vancomycin
C. Rifampin
D. Linezolid

正確答案：A. Fluoroquinolones